68 歲女性，住院時血鈉為 140 meq/L，因準備隔日大腸鏡檢查接受口服瀉劑及灌腸，於清晨突發意識不清及癲癇發作，其血清學檢查發現血鈉 117 meq/L，則下列敘述何者正確？
A. 應給予鹽片治療並限水
B. 應嚴密監控血清鈉離子濃度，每小時濃度上升應小於 0.5~1.0 meq/L，以避免滲透壓去髓鞘症候群（osmotic demyelination syndrome）
C. 應快速給予高滲透度食鹽水（hypertonic saline），直到神經學症狀改善
D. 應限制水分及鹽分攝取

正確答案：C. 應快速給予高滲透度食鹽水（hypertonic saline），直到神經學症狀改善